Clinical trial exclusion criterion:
3. Women with abnormally high liver enzymes or liver disease. (ALT or AST exceeding 2.0 x ULN AND total bilirubin exceeding 1.5 x ULN at screening and confirmed on repeat).

Annotated entities:
- Parsing_Error: "3."
- Person: "Women"
- Measurement: "liver enzymes"
- Condition: "liver disease"
- Value: "high"
- Measurement: "ALT"
- Measurement: "AST"
- Value: "exceeding 2.0 x ULN"
- Measurement: "total bilirubin"
- Value: "exceeding 1.5 x ULN"
- Temporal: "at screening"
- Reference_point: "screening"